Clinical trial exclusion criterion:
Prior lung transplant, LVRS, median sternotomy, bullectomy or lobectomy.

Annotated entities:
- Procedure: "lung transplant"
- Temporal: "Prior"
- Procedure: "LVRS"
- Procedure: "median sternotomy"
- Procedure: "bullectomy"
- Procedure: "lobectomy"